一位 12 歲男童主訴過去半年來一再有腹痛發作。其父親、祖父及外祖父過去均有消化性潰瘍之病史。男童父母強烈要求你為男童作檢查是否有消化性潰瘍。下列何項檢查最能確定男童是否有幽門螺旋菌所致之消化性潰瘍？
A. 檢查糞便是否有該菌之抗原
B. 內視鏡檢查並作胃生檢
C. 氫氣呼氣試驗
D. 檢測血清中該菌之抗體

正確答案：B. 內視鏡檢查並作胃生檢